Clinical trial exclusion criterion:
Treated with greater than 10 mg of prednisone (or equivalent) daily in the last 6 months

Annotated entities:
- Multiplier: "greater than 10 mg"
- Drug: "prednisone"
- Multiplier: "daily"
- Temporal: "in the last 6 months"